Clinical trial exclusion criterion:
If Pregnancy is present

Annotated entities:
- Condition: "Pregnancy"